10 = Beck Depression Inventory (BDI) <30 points

The above is a clinical trial inclusion criterion. Annotated with entity spans:
10 = [Measurement: Beck Depression Inventory (BDI)] [Value: <30 points]